Clinical trial exclusion criterion:
SpO2 < 90 %

Entity relations:
- Has_value("SpO2", "< 90 %")